Has or is suspected of having an allergy to study treatments or its/their excipients, to opioids/opiates, muscle relaxants or their excipients, or other medication(s) used during general anesthesia.

The above is a clinical trial exclusion criterion. Annotated with entity spans:
Has or is suspected of having an [Condition: allergy] to [Procedure: study treatments] or its/their [Drug: excipients], to [Drug: opioids]/[Drug: opiates], [Drug: muscle relaxants] or their [Drug: excipients], or [Qualifier: other] [Drug: medication](s) used [Temporal: during general anesthesia].